有關帶狀疱疹眼炎（herpes zoster ophthalmicus）之敘述，下列何者錯誤？
A. 較常發生於中、老年人或免疫不全病人
B. 皮膚病變出現在三叉神經（trigeminal nerve）所支配之範圍
C. 早期服用抗病毒藥物（如 acyclovir）可降低發生疱疹後神經痛（post-herpetic neuralgia）的機率
D. 口服類固醇為絕對禁忌

正確答案：D. 口服類固醇為絕對禁忌